Clinical trial exclusion criterion:
1. Clinically significant microvascular complications: nephropathy (estimated glomerular filtration rate below 40 ml/min), neuropathy (especially diagnosed gastroparesis) or severe proliferative retinopathy as judged by the investigator.

Annotated entities:
- Parsing_Error: "1."
- Condition: "microvascular complications"
- Measurement: "estimated glomerular filtration rate"
- Value: "below 40 ml/min"
- Condition: "nephropathy"
- Condition: "neuropathy"
- Condition: "gastroparesis"
- Condition: "severe proliferative retinopathy"
- Subjective_judgement: "as judged by the investigator"
- Qualifier: "as judged by the investigator"